Clinical trial inclusion criterion:
Moderate to severe pain (NVS>4).

Entity relations:
- Has_value("NVS", ">4)")
- AND("pain", "NVS")
- Has_qualifier("pain", "Moderate")
- OR("Moderate", "severe")